Patient must consent to the procedure

The above is a clinical trial inclusion criterion. Annotated with entity spans:
Patient must [Observation: consent to the procedure]